Clinical trial exclusion criteria:
Contraindication for hepatectomy, including gastrointestinal hemorrhage, severe hemorrhagic disorders, explicit acute nonspecific infectious lesion, overt ascites, Child-Pugh Score C, indocyanine green retention rate at 15min (ICGR15)＞30%(12), serum hepatitis B virus (HBV)-DNA＞126 copies/ml and serum alanine aminotransferase (ALT) ＞ 2×ULN, serum triglycerides＞2.0 mmol/L, circulatory shock, stroke, acute myocardial infarction, renal failure, coma of unknown cause
Pregnancy
Age of＜18y or＞75y
Performed intraoperative ablation
Unresectable tumor during operation
Allergic reactions against fish or egg proteins

Annotated entities:
- Condition: "Contraindication for hepatectomy"
- Condition: "gastrointestinal hemorrhage"
- Condition: "hemorrhagic disorders"
- Qualifier: "severe"
- Condition: "infectious lesion"
- Qualifier: "nonspecific"
- Temporal: "acute"
- Condition: "ascites"
- Qualifier: "overt"
- Measurement: "Child-Pugh Score"
- Value: "C"
- Measurement: "indocyanine green retention rate at 15min (ICGR15)"
- Value: "＞30%"
- Measurement: "serum hepatitis B virus (HBV)-DNA"
- Value: "＞126 copies/ml"
- Measurement: "serum alanine aminotransferase (ALT)"
- Value: "＞ 2×ULN"
- Measurement: "serum triglycerides"
- Value: "＞2.0 mmol/L"
- Condition: "circulatory shock"
- Condition: "stroke"
- Condition: "acute myocardial infarction"
- Condition: "renal failure"
- Condition: "coma"
- Qualifier: "unknown cause"
- Procedure: "hepatectomy"
- Condition: "Pregnancy"
- Person: "Age"
- Value: "＜18y or＞75y"
- Procedure: "intraoperative ablation"
- Condition: "Unresectable tumor"
- Drug: "fish proteins"
- Drug: "egg proteins"
- Condition: "Allergic reactions"